Clinical trial exclusion criterion:
Bleeding diathesis, thrombocytopenia, or use of anticoagulants that would contraindicate lumbar puncture.

Entity relations:
- AND("contraindicate", "lumbar puncture")
- AND("anticoagulants", "contraindicate")
- OR("Bleeding diathesis", "anticoagulants", "thrombocytopenia")